Clinical trial inclusion criterion:
T2DM as defined by American Diabetes Association (ADA) criteria

Entity relations:
- Has_qualifier("T2DM", "American Diabetes Association (ADA) criteria")